Clinical trial inclusion criteria:
Pediatric patients with deep dental decay in primary molars
Teeth with signs and symptoms of reversible pulpitis

Annotated entities:
- Person: "Pediatric"
- Condition: "deep dental decay"
- Qualifier: "primary molars"
- Qualifier: "Teeth"
- Condition: "reversible pulpitis"